Clinical trial inclusion criterion:
BMI = 50 kg/m2

Annotated entities:
- Measurement: "BMI"
- Value: "= 50 kg/m2"